Clinical trial exclusion criterion:
Newborns with any contraindications to routine circumcision, anatomical or hematologic.

Annotated entities:
- Person: "Newborns"
- Condition: "contraindications"
- Procedure: "circumcision"